En la prevalencia de los principios bioéticos, los principios de justicia y de no maleficencia se encuadran en una ética:
1. De máximos.
2. De mínimos.
3. Deontológica.
4. Pluralista.
5. De excelencia.

Respuesta correcta: 2. De mínimos.